下列有關肺氣腫（emphysema）之敘述，何者錯誤？
A. 是一種肺泡組織被破壞的疾病
B. 生理性無效腔（physiologic dead space）增加
C. 用力呼氣時，易造成小呼吸道塌陷
D. 第一秒用力呼氣容積與用力肺活量的百分比（FEV1/FVC）大於 80 %

正確答案：D. 第一秒用力呼氣容積與用力肺活量的百分比（FEV1/FVC）大於 80 %